5. non reassuring fetal heart rate.

The above is a clinical trial exclusion criterion. Annotated with entity spans:
5. [Qualifier: non reassuring] [Measurement: fetal heart rate].